Able to give informed consent

The above is a clinical trial inclusion criterion. Annotated with entity spans:
[Observation: Able to give informed consent]